下列何項藥品於給藥時應快速靜脈注射，才能達到臨床療效？
A. KCl
B. Lidocaine
C. Gentamicin
D. Adenosine

正確答案：D. Adenosine